Clinical trial inclusion criterion:
Atrial fibrillation and not on oral anticoagulation (OAC) therapy but eligible

Entity relations:
- AND("oral anticoagulation (OAC) therapy", "not")